Are pregnant.

The above is a clinical trial exclusion criterion. Annotated with entity spans:
Are [Condition: pregnant].